Clinical trial exclusion criterion:
Positive serology for C hepatitis in the screening evaluation;

Entity relations:
- Has_value("serology for C hepatitis", "Positive")
- Has_temporal("serology for C hepatitis", "in the screening evaluation")
- Has_index("in the screening evaluation", "screening evaluation")